下列關於黑色棘皮症（acanthosis nigricans）的敘述何者為錯誤？
A. 可能與胰島素抗性（insulin resistance）的內分泌疾病有關
B. 可能由藥物引起，例如菸鹼酸（nicotinic acid）
C. 移除相關的內臟惡性腫瘤後，皮膚病灶可能消失
D. 對於肥胖相關的黑色棘皮症，減重對於皮膚病灶沒有改善作用

正確答案：D. 對於肥胖相關的黑色棘皮症，減重對於皮膚病灶沒有改善作用